El factor general dependiente del paciente que condiciona el proceso de cicatrización tisular es:
1. Vascularización de los tejidos.
2. Grado de contaminación bacteriana.
3. Respuesta inmunológica.
4. Presencia de cuerpos extraños.

Respuesta correcta: 3. Respuesta inmunológica.